下列那一種鴉片類藥物所產生的藥理作用，最不容易產生耐受性？
A. 止痛作用（analgesia）
B. 瞳孔縮小（miosis）
C. 呼吸抑制作用（respiratory depression）
D. 鎮靜作用（sedation）

正確答案：B. 瞳孔縮小（miosis）